El sistema que integra la asistencia y el cuidado que proporciona la familia, los vecinos o allegados sin que exista ninguna relación contractual y basado en unas relaciones personales estrechas, se corresponde con:
1. Asistencia social.
2. Sistema de atención integral.
3. Sistema informal de cuidados.
4. Atención sociosanitaria.
5. Prestación social.

Respuesta correcta: 3. Sistema informal de cuidados.